下列敘述，何者錯誤？
A. 分布體積（Vd），為藥物實際分布體積
B. 肝、腎功能對於藥物清除率（CL）有很重要之影響
C. 當給藥之後，血漿藥物濃度降至原來一半所需的時間，稱為半衰期（t1/2）
D. 靜脈（IV）給藥之生體可用率（bioavailability）為 100%

正確答案：A. 分布體積（Vd），為藥物實際分布體積